Clinical trial exclusion criterion:
Participation in the 4 weeks preceding inclusion or planned participation during the present trial period in another clinical trial investigating a vaccine, drug, medical device, or medical procedure.

Entity relations:
- Has_index("4 weeks preceding inclusion", "inclusion")